Weight less than 40.0 kg.

The above is a clinical trial exclusion criterion. Annotated with entity spans:
[Measurement: Weight] [Value: less than 40.0 kg].